La pérdida de linealidad de la recta de calibrado cuando se utiliza la intensidad de fluorescencia como parámetro analítico puede ser debida a:
1. Cambios en la densidad del disolvente a medida que la concentración de analito fluorescente aumenta.
2. El oxígeno disuelto, debido a su carácter diamagnético, que favorece el cruce intersistemas.
3. La presencia de inhibidores estáticos de la radiación incidente.
4. Conversión interna, en la que la energía absorbida puede transformarse en energía calorífica.
5. Autoabsorción, al efecto interno de cubeta y a la formación de dímeros y excímeros.

Respuesta correcta: 5. Autoabsorción, al efecto interno de cubeta y a la formación de dímeros y excímeros.